Clinical trial inclusion criterion:
Patient with evidence of endoscopic active proctitis or distal proctosigmoiditis (Montreal classification E1 or E2 defined by an involvement not exceeding 25 cm from the anal margin) within 6 months before study inclusion.

Entity relations:
- Subsumes("E1 or E2", "involvement not exceeding 25 cm from the anal margin")
- Has_value("Montreal classification", "E1 or E2")
- AND("active proctitis", "Montreal classification")
- AND("active proctitis", "endoscopic")
- Has_index("within 6 months before study inclusion", "study inclusion")
- OR("active proctitis", "distal proctosigmoiditis")